Fecal transplantation is used to treat infection with what bacteria?

Fecal microbiota transplantation is used to treat Clostridium difficile infection